Psychiatric desease

The above is a clinical trial exclusion criterion. Annotated with entity spans:
[Condition: Psychiatric desease]